Use of anti-allergic with antigen injections in a maximum timeline of 14 days before the vaccination;

The above is a clinical trial exclusion criterion. Annotated with entity spans:
Use of [Drug: anti-allergic] with [Procedure: antigen injections] in a [Temporal: maximum timeline of 14 days before the vaccination];